HER-2 belongs to what family of proteins?

Her-2 belongs to the human epidermal growth factor receptor 2 (EGF) family of proteins.